Clinical trial inclusion criteria:
Body Mass Index (BMI) = 35 kg/m2
HbA1c = 5.7%
Ability to speak and understand English

Annotated entities:
- Measurement: "Body Mass Index (BMI)"
- Value: "= 35 kg/m2"
- Measurement: "HbA1c"
- Value: "= 5.7%"
- Observation: "Ability to speak English"
- Observation: "Ability to understand English"